Clinical trial inclusion criterion:
Glomerular filtration rate (GFR) ≥ 40 ml/min (estimated using Modification of Diet in Renal Disease (MDRD) formula) in the last 4 months.

Entity relations:
- Has_value("Glomerular filtration rate (GFR)", "≥ 40 ml/min")
- Has_qualifier("Glomerular filtration rate (GFR)", "Modification of Diet in Renal Disease (MDRD) formula")
- Has_temporal("Glomerular filtration rate (GFR)", "in the last 4 months")